Clinical trial exclusion criterion:
The patient is unwilling to provide informed consent

Annotated entities:
- Informed_consent: "The patient is unwilling to provide informed consent"